下列關節活動度中，何者最大？
A. 第五掌骨（5th metacarpal bone）與其近端指骨間的關節
B. 第一掌骨（1st metacarpal bone）與其近端指骨間的關節
C. 第五掌骨（5th metacarpal bone）與腕骨間的關節
D. 第一掌骨（1st metacarpal bone）與腕骨間的關節

正確答案：D. 第一掌骨（1st metacarpal bone）與腕骨間的關節